¿A qué se debe la presencia de léntigo en las personas mayores?
1. Deshidratación celular.
2. Pequeñas hemorragias por fragilidad capilar.
3. Hiperplasia de melanocitos intraepidérmicos.
4. Déficit de colágeno y elastina.
5. Depósitos de lipofuscina.

Respuesta correcta: 3. Hiperplasia de melanocitos intraepidérmicos.